Clinical trial inclusion criteria:
Infertile lean women with PCOS as defined by the Rotterdam criteria.
CC resistance (defined as failure of ovulation after receiving 150 mg/day of CC for 5 consecutive days per cycle, for at least 3 consecutive cycles).

Annotated entities:
- Condition: "Infertile"
- Person: "women"
- Condition: "PCOS"
- Qualifier: "Rotterdam criteria"
- Condition: "resistance"
- Drug: "CC"
- Non-query-able: "defined as failure of ovulation after receiving 150 mg/day of CC for 5 consecutive days per cycle, for at least 3 consecutive cycles"